Clinical trial inclusion criterion:
Patients with angina or silent ischemia and documented ischemia

Annotated entities:
- Condition: "angina"
- Condition: "ischemia"
- Qualifier: "silent"
- Qualifier: "documented"
- Condition: "ischemia"
- Grammar_Error: "and"